Treatment with strong CYP3A4-inhibitors (e.g. ketoconazole, clarithromycin, nefazodone, ritonavir or atazanavir)

The above is a clinical trial exclusion criterion. Annotated with entity spans:
Treatment with [Drug: strong CYP3A4-inhibitors] (e.g. [Drug: ketoconazole], [Drug: clarithromycin], [Drug: nefazodone], [Drug: ritonavir] or [Drug: atazanavir])